Clinical trial inclusion criterion:
Patients with posterior or posterolateral disc herniations at one level between L1 and S1 with radiographic confirmation of neural compression using CT and/or MRI.

Entity relations:
- AND("neural compression", "CT")
- Has_qualifier("disc herniations", "one level between L1 and S1")
- Has_qualifier("disc herniations", "radiographic confirmation")
- Has_qualifier("disc herniations", "posterior")
- AND("radiographic confirmation", "neural compression")
- OR("posterior", "posterolateral")
- OR("CT", "MRI")